胰蛋白酶（trypsin）切於蛋白質內何種胺基酸之羧端？
A. 苯丙胺酸（phenylalanine）
B. 離胺酸（lysine）
C. 甲硫胺酸（methionine）
D. 天冬胺酸（aspartate）

正確答案：B. 離胺酸（lysine）